What is the effect of Satb1 knock-out in mice?

Knock-out of Satb1 significantly inhibited cell viability and migration, and promoted Schwann cells apoptosis.